COPD患者休息狀態時，動脈血已出現缺氧現象，該病患較不可能因COPD而出現下列那一項呼吸生理的障礙？
A. 第一秒吐氣量（FEV1）低於預期值的50%
B. 分流（shunt）增加
C. 換氣／灌流失衡（ventilation/perfusion mismatching）
D. 第一秒吐氣量（FEV1）低於預期值的25%時，可能同時伴有動脈血中二氧化碳升高（PaCO2）

正確答案：B. 分流（shunt）增加